Clinical trial exclusion criteria:
implanted hardware or other material that would prohibit treatment planning or delivery
chemotherapy for a malignancy within the previous 5 years
history of an invasive malignancy (other than this prostate cancer,or basal or squamous skin cancers) within prior 5 years
hormone ablation for 2 months prior to treatment or during treatment

Annotated entities:
- Non-query-able: "implanted hardware or other material that would prohibit treatment planning or delivery"
- Procedure: "chemotherapy"
- Condition: "malignancy"
- Temporal: "within the previous 5 years"
- Condition: "invasive malignancy"
- Negation: "other than"
- Condition: "prostate cancer"
- Condition: "squamous skin cancers"
- Condition: "basal skin cancers"
- Temporal: "within prior 5 years"
- Procedure: "hormone ablation"
- Temporal: "for 2 months prior to treatment"
- Reference_point: "treatment"
- Temporal: "during treatment"
- Reference_point: "treatment"